Clinical trial exclusion criterion:
History of malignancy with chemotherapy

Annotated entities:
- Condition: "malignancy"
- Procedure: "chemotherapy"